Symptomatic patients with heart failure (men and women) aged >18 years,

The above is a clinical trial inclusion criterion. Annotated with entity spans:
[Condition: Symptomatic] patients with [Condition: heart failure] ([Person: men] and [Person: women]) [Person: aged] [Value: >18 years],